El trastorno de ansiedad que según los estudios con gemelos monocigóticos y dicigóticos parece menos influenciado por factores genéticos es:
1. La ansiedad generalizada.
2. El trastorno de pánico (o de angustia).
3. Las fobias.
4. El trastorno obsesivo-compulsivo.
5. El trastorno facticio.

Respuesta correcta: 1. La ansiedad generalizada.